Clinical trial inclusion criterion:
Both partners plan on remaining in Montreal for at least 1 year

Entity relations:
- Has_multiplier("remaining in Montreal", "for at least 1 year")
- Has_mood("remaining in Montreal", "plan on")